Clinical trial inclusion criteria:
Male and females between ages 18-85 years
Right handed
Able to complete precision grips with both hands
Able to complete full wrist flexion-extension bilaterally
Able to walk unassisted
Able to complete full ankle flexion-extension bilaterally
Male and females between ages 18-85 years
SCI ( 2 months of injury)
Spinal Cord injury at or above L5
The ability to produce a visible precision grip force with one hand
Able to perform some small wrist flexion and extension
The ability to perform a small visible contraction with dorsiflexion and hip flexor muscles
No subjects will be excluded based on their race, religion, ethnicity, gender or HIV status.
ASIA A,B,C, or D

Annotated entities:
- Person: "females"
- Person: "Male"
- Value: "between 18-85 years"
- Person: "ages"
- Condition: "Right handed"
- Procedure: "complete precision grips with both hands"
- Mood: "Able to"
- Procedure: "complete full wrist flexion-extension bilaterally"
- Mood: "Able to"
- Procedure: "walk unassisted"
- Mood: "Able to"
- Mood: "Able to"
- Procedure: "complete full ankle flexion-extension bilaterally"
- Person: "Male"
- Person: "females"
- Value: "between 18-85 years"
- Person: "ages"
- Condition: "SCI"
- Temporal: "2 months of injury"
- Condition: "Spinal Cord injury"
- Qualifier: "at or above L5"
- Procedure: "produce a visible precision grip force with one hand"
- Mood: "The ability to"
- Mood: "Able to"
- Procedure: "small wrist flexion and extension"
- Mood: "The ability to"
- Procedure: "small visible contraction with dorsiflexion and hip flexor muscles"
- Non-representable: "No subjects will be excluded based on their race, religion, ethnicity, gender or HIV status."
- Measurement: "ASIA"
- Value: "A,B,C, or D"